Which mutated genes are associated with the Tourette's syndrome?

A mutation in histidine decarboxylase (Hdc) gene as well as mutations in the SLITRK1 (Slit and Trk-like 1) gene have been implicated as rare genetic causes of Tourette's syndrome.